Clinical trial inclusion criterion:
Patients in whom a LEN-DEX-based treatment regimen is indicated

Entity relations:
- AND("LEN-DEX-based", "LEN")
- AND("LEN-DEX-based", "DEX")
- Has_qualifier("treatment regimen", "LEN-DEX-based")
- Has_mood("treatment regimen", "is indicated")